下列那一項不是失鹽型（salt-wasting type）典型 21-羥化酶缺乏（classical 21-hydroxylase deficiency）所致先天性腎上腺增生（congenital adrenal hyperplasia）之男病童的臨床表徵？
A. 約於出生後兩週發病
B. 性器混淆（ambiguous genitalia）
C. 低血鈉（hyponatremia）
D. 高血鉀（hyperkalemia）

正確答案：B. 性器混淆（ambiguous genitalia）